Carrier of prosthetic mesh in the ostomy

The above is a clinical trial exclusion criterion. Annotated with entity spans:
Carrier of [Device: prosthetic mesh] in the [Procedure: ostomy]